Clinical trial inclusion criterion:
Symptomatic or asymptomatic coronary artery disease patients

Entity relations:
- Has_qualifier("coronary artery disease", "Symptomatic")
- OR("Symptomatic", "asymptomatic")